關於廣泛性焦慮症（generalized anxiety disorder）的敘述，下列何者正確？
A. 同時合併重度憂鬱症的個案占非常少數
B. 通常在成年的早期就開始發病
C. 超過九成以上的患者曾經歷恐慌症發作
D. 男女罹患此疾病的比率約略相等

正確答案：B. 通常在成年的早期就開始發病